Lipofuscin 色素是源於：
A. 黑色素（melanin）
B. 鐵（iron）
C. 膽紅素（bilirubin）
D. 脂肪過氧化（lipid peroxidation）

正確答案：D. 脂肪過氧化（lipid peroxidation）